Clinical trial inclusion criteria:
>/= 18 years old
Atrial fibrillation or flutter on electrocardiogram
Heart rate >110 beats/min
Systolic blood pressure >/= 90 mmHg

Annotated entities:
- Value: ">/= 18 years old"
- Person: "old"
- Condition: "Atrial fibrillation"
- Condition: "Atrial flutter"
- Procedure: "electrocardiogram"
- Measurement: "Heart rate"
- Value: ">110 beats/min"
- Measurement: "Systolic blood pressure"
- Value: ">/= 90 mmHg"